Relacionado con la necesidad de alimentación en personas que han sufrido problemas neurológicos, señale la respuesta INCORRECTA:
1. Es conveniente mezclar alimentos sólidos con líquidos para facilitar la deglución.
2. Se deben evitar elementos de distracción durante el momento de la alimentación.
3. La persona debe mantener una postura erguida, sentado y con ligera flexión anterior del cuello.
4. Se debe realizar una adecuada higiene oral tras la ingesta.

Respuesta correcta: 1. Es conveniente mezclar alimentos sólidos con líquidos para facilitar la deglución.